What does the pembrolizumab companion diagnostic test assess?

Administration of pembrolizumab requires a companion diagnostic test, to assess PD-L1 status of patients.